Clinical trial inclusion criterion:
gastric malignancy, including adenocarcinoma and lymphoma,

Entity relations:
- Subsumes("gastric malignancy", "adenocarcinoma")
- OR("adenocarcinoma", "lymphoma")